Stone free after definitive surgical therapy defined as fragments less than 3mm.

The above is a clinical trial inclusion criterion. Annotated with entity spans:
[Condition: Stone] [Negation: free] [Temporal: after definitive surgical therapy] defined as [Qualifier: fragments less than 3mm].